Drug addiction, alcohol use in the amount over 2 units of alcohol a day, mental diseases.

The above is a clinical trial exclusion criterion. Annotated with entity spans:
[Condition: Drug addiction], [Measurement: alcohol use] in the amount [Value: over 2 units of alcohol a day], [Condition: mental diseases].